Clinical trial inclusion criterion:
Willing to provide multiple blood specimens collected by venipuncture

Annotated entities:
- Non-query-able: "Willing to provide multiple blood specimens collected by venipuncture"